Con un diseño de investigación ex post facto de “casos y controles” en el que comparamos un grupo seleccionado por poseer una determinada característica (casos) y el otro por no poseerla (controles):
1. Aseguramos       la    relación   antecedenteconsecuente entre la variable independiente y la dependiente.
2. Podemos descartar la existencia de hipótesis alternativas de explicación debidas a variables enmascaradas.
3. No debemos extraer conclusiones de causalidad porque existen amenazas a la validez interna del estudio debidas a variables extrañas no controladas.
4. No podemos considerar variables como el género o la edad como variables de estudio por no ser manipulables.
5. Los datos deben ser analizados en términos de cambio por su carácter longitudinal.

Respuesta correcta: 3. No debemos extraer conclusiones de causalidad porque existen amenazas a la validez interna del estudio debidas a variables extrañas no controladas.